關於男童性早熟（precocious puberty），下列那一項的致病機轉與其他三者不同？
A. 下視丘錯構瘤（hypothalamic hamartoma）
B. 分泌人類絨毛膜性腺促素（hCG-secreting）的松果腺腫瘤（pineal tumor）
C. 先天性腎上腺增生（congenital adrenal hyperplasia）
D. 萊氏細胞瘤（Leydig cell tumor）

正確答案：A. 下視丘錯構瘤（hypothalamic hamartoma）